Clinical trial exclusion criteria:
Women with systemic lupus erythematosus (SLE)
Women with active thromboembolic disorders
Women with history of previous thromboembolic disorders

Annotated entities:
- Person: "Women"
- Condition: "systemic lupus erythematosus (SLE)"
- Person: "Women"
- Qualifier: "active"
- Condition: "thromboembolic disorders"
- Person: "Women"
- Temporal: "history"
- Temporal: "previous"
- Condition: "thromboembolic disorders"